下列有關腹水的敘述，何者錯誤？
A. serum ascites-to-albumin gradient（SAAG）＞1.1 g/dL 表示腹水的原因最可能為門脈高壓
B. 腹水白蛋白濃度低較容易發生自發性細菌性腹膜炎
C. 腹水內多核白血球＞250/mm3時，要考慮感染的可能性
D. hepatic hydrothorax 多發生在左側

正確答案：D. hepatic hydrothorax 多發生在左側